Clinical trial inclusion criterion:
Liver imaging within 6 months of Baseline/Day 1 to exclude hepatocellular carcinoma HCC) is required

Annotated entities:
- Procedure: "Liver imaging"
- Temporal: "within 6 months of Baseline/Day 1"
- Condition: "hepatocellular carcinoma HCC)"
- Negation: "exclude"